Niño de 12 meses de edad, que en los exámenes de salud practicados desde el nacimiento presenta testículo derecho en conducto inguinal que no es posible descender hasta el escroto. Señale la respuesta CORRECTA:
1. El diagnóstico más probable es el de testículo retráctil.
2. Se ha de esperar hasta los dos años de edad a que ocurra descenso espontáneo del mismo.
3. La gonadotropina coriónica humana es el tratamiento de primera elección.
4. La indicación de orquidopexia no debe diferirse.

Respuesta correcta: 4. La indicación de orquidopexia no debe diferirse.